Clinical trial exclusion criterion:
Antiemetic drug use in the 24 hours prior to cesarean delivery,

Entity relations:
- Has_index("in the 24 hours prior to cesarean delivery", "cesarean delivery")
- multi("cesarean delivery", "cesarean delivery")
- Has_temporal("Antiemetic drug", "in the 24 hours prior to cesarean delivery")